DNA的序列中，下列何者較易被甲基化？
A. TATA box
B. CpG site
C. CAAT box
D. Telomere

正確答案：B. CpG site